Males or females aged >/= 50 years

The above is a clinical trial inclusion criterion. Annotated with entity spans:
[Person: Males] or [Person: females] [Person: aged] [Value: >/= 50 years]